歐勃氏麻痺（Erb's palsy）的新生兒，上肢常呈現何種姿勢？
A. 肘伸直（extension）、前臂旋後（supination）、腕屈曲（flexion）
B. 肘屈曲（flexion）、前臂旋後（supination）、腕背屈（extension）
C. 肘伸直（extension）、前臂旋前（pronation）、腕屈曲（flexion）
D. 肘屈曲（flexion）、前臂旋前（pronation）、腕背屈（extension）

正確答案：C. 肘伸直（extension）、前臂旋前（pronation）、腕屈曲（flexion）